La piruvato deshidrogenasa (PDH):
1. Cataliza la transformación reversible de piruvato en acetil-CoA y viceversa.
2. Cataliza la carboxilación irreversible del piruvato en citrato, y con ello, su entrada en el ciclo del ácido cítrico.
3. Conecta la degradación de los carbohidratos, con la síntesis de acetil-CoA y su entrada en el ciclo del ácido cítrico.
4. Permite emplear el acetil-CoA derivado de la degradación de los ácidos grasos para la síntesis de glucosa.
5. Se activa en presencia de altas concentraciones de acetil-CoA y NADH+H+.

Respuesta correcta: 3. Conecta la degradación de los carbohidratos, con la síntesis de acetil-CoA y su entrada en el ciclo del ácido cítrico.